Clinical trial inclusion criterion:
3. Consent to participation in the study.

Annotated entities:
- Parsing_Error: "3."
- Non-query-able: "Consent to participation in the study."